Clinical trial inclusion criteria:
ASA I & II, Nulliparous and Multiparous, Spontaneous/Induced/Augmented Labor, Early active labor (cervix <5 cm (if known)), Pain (VPS) > 3, 18-45 years of age

Annotated entities:
- Measurement: "ASA"
- Value: "I & II"
- Condition: "Nulliparous"
- Condition: "Multiparous"
- Procedure: "Augmented Labor"
- Procedure: "Induced Labor"
- Condition: "Spontaneous Labor"
- Condition: "Early active labor"
- Measurement: "cervix"
- Value: "<5 cm"
- Measurement: "Pain (VPS)"
- Value: "> 3"
- Value: "18-45 years"
- Person: "age"